Clinical trial inclusion criterion:
Age: 10-18 years.

Entity relations:
- Has_value("Age", "10-18 years")